Clinical trial exclusion criterion:
14. Uncontrolled or significant cardiovascular disease

Entity relations:
- Has_qualifier("cardiovascular disease", "Uncontrolled")
- OR("Uncontrolled", "significant")